Pregnancy at enrollment.

The above is a clinical trial exclusion criterion. Annotated with entity spans:
[Condition: Pregnancy] [Temporal: at enrollment].